對於腹內壓增加所造成的生理反應，下列何者錯誤？
A. 腎臟血流減少
B. 中央靜脈壓力減少
C. 心跳增加
D. 肋膜內（intrapleural）壓力增加

正確答案：B. 中央靜脈壓力減少